牙齒及其周邊結構大多是中胚層（mesodermal）或神經嵴（neural crest）之衍生物，但下列何者例外？
A. 齒質（dentin）
B. 齒堊質（cementum）
C. 琺瑯質（enamel）
D. 髓腔（pulp）

正確答案：C. 琺瑯質（enamel）